Subject has any contraindication for oral anticoagulation.

The above is a clinical trial exclusion criterion. Annotated with entity spans:
Subject has any [Condition: contraindication] for [Drug: oral anticoagulation].